Suspicion of neurologic dysfunction at tested sites

The above is a clinical trial inclusion criterion. Annotated with entity spans:
[Mood: Suspicion] of [Condition: neurologic dysfunction] at [Qualifier: tested sites]